下列選項何者不是 Gitelman's syndrome 的特徵？
A. 低血鉀
B. 代謝性鹼中毒
C. 低血鎂
D. 高尿鈣

正確答案：D. 高尿鈣